Human dihydroorotate dehydrogenase is a drug target and is involved in what biosynthetic pathway

Dihydroorotate dehydrogenase (DHODH) mediates the fourth step of de novo pyrimidine biosynthesis